Clinical trial exclusion criterion:
platelet count less than 100.000/mm3;

Annotated entities:
- Measurement: "platelet count"
- Value: "less than 100.000/mm3"